Cuál de las siguientes técnicas es considerada, según la evidencia disponible, un tratamiento bien establecido en el caso de las fobias infantiles:
1. El modelado participante.
2. El entrenamiento en asertividad y HHSS.
3. Las imágenes emotivas.
4. La terapia basada en el juego.

Respuesta correcta: 1. El modelado participante.